下列那些致病菌主要透過節肢動物（arthropods）的叮咬而傳染，並能在人類細胞內繁殖？ ①宋內志賀氏菌 （Shigella sonnei） ②馬爾他布魯氏菌（Brucella melitensis） ③土拉弗朗西斯菌（Francisella tularensis） ④嗜吞噬細胞無形體（Anaplasma phagocytophilum）
A. ①②
B. ③④
C. ②④
D. ①③

正確答案：B. ③④